Alcohol abuse

The above is a clinical trial exclusion criterion. Annotated with entity spans:
[Observation: Alcohol abuse]